54 歲的林經理患有高血壓，一直沒有治療，現因缺血性中風住院，經實證醫學證明急性腦梗塞及腦血栓病人之血壓高於下列何種數值才需處理？
A. 180/110 mmHg
B. 140/100 mmHg
C. 130/90 mmHg
D. 120/80 mmHg

正確答案：A. 180/110 mmHg